What class of drugs is commonly associated with Drug-induced interstitial lung disease (DIILD)?

[' Numerous agents including cytotoxic and noncytotoxic drugs have the potential to cause pulmonary toxicity.']